Clinical trial exclusion criterion:
Asthma or Chronic Obstructive pulmonary Disease

Entity relations:
- OR("Asthma", "Chronic Obstructive pulmonary Disease")